Clinical trial exclusion criterion:
on going neoplastic history with a short prognosis,

Entity relations:
- Has_temporal("neoplastic", "history")
- Has_temporal("neoplastic", "on going")
- Has_value("prognosis", "short")
- AND("neoplastic", "prognosis")